心房顫動（atrial fibrillation）可能導致栓塞性腦中風，其危險因素中並不包括下列何者？
A. 快速心室速率（rapid ventricular rate）
B. 高血壓
C. 糖尿病
D. 年紀超過 75 歲

正確答案：A. 快速心室速率（rapid ventricular rate）